Clinical trial inclusion criterion:
At least one patent (less than 50 percent stenosed) tibioperoneal runoff vessel.

Entity relations:
- Has_multiplier("patent tibioperoneal runoff vessel", "At least one")